Clinical trial exclusion criterion:
Known hyperoxaluria

Annotated entities:
- Condition: "hyperoxaluria"